Clinical trial exclusion criterion:
Estimated glomerular filtration rate (eGFR by MDRD) =20 mL/min per 1.73 m2 or serum creatinine >300 micromol/L (3.39 mg/dL) at screening.

Entity relations:
- Subsumes(">300 micromol/L", "3.39 mg/dL")
- Has_value("serum creatinine", ">300 micromol/L")
- Subsumes("Estimated glomerular filtration rate", "eGFR")
- Has_value("Estimated glomerular filtration rate", "=20 mL/min per 1.73 m2")
- OR("Estimated glomerular filtration rate", "serum creatinine")